Clinical trial inclusion criterion:
Subjects who are able and willing to undergo elective cardiac magnetic resonance (MR) scanning without sedation (MRI-group)

Entity relations:
- Subsumes("cardiac magnetic resonance scanning", "MR")
- Has_qualifier("cardiac magnetic resonance scanning", "without sedation")
- Has_qualifier("cardiac magnetic resonance scanning", "elective")
- Has_mood("cardiac magnetic resonance scanning", "willing to undergo")